Recibe usted a un paciente ingresado a su cargo en el hospital desde el Servicio de Urgencias la noche anterior. En la reunión de primera hora la enfermera le informa que está intranquilo. ¿Cuál de las siguientes actitudes debe evitar?
1. Leer el informe de Urgencias y solicitar las pruebas urgentes que estime conveniente y que deban realizarse en ayunas.
2. Modificar el tratamiento según la impresión de la enfermera y los signos vitales disponibles en la gráfica.
3. Realizar la historia clínica, anamnesis, exploración física, registrar todo ello en el sistema de documentación clínica del hospital, dejando constancia de la impresión diagnóstica y del plan.
4. Informar al paciente y a la persona que entiende de su caso de las perspectivas del ingreso.

Respuesta correcta: 2. Modificar el tratamiento según la impresión de la enfermera y los signos vitales disponibles en la gráfica.